Clinical trial exclusion criterion:
Toxic epidermal necrolysis with SCORTEN 6 or 7 at admission

Entity relations:
- Has_index("at admission", "admission")
- Has_temporal("SCORTEN", "at admission")
- Has_value("SCORTEN", "6 or 7")